Clinical trial exclusion criterion:
Patients with occult or prior HBV infection (defined as positive total hepatitis B core antibody [HBcAb] and negative HBsAg) may be included if HBV DNA is undetectable. These patients must be willing to undergo monthly DNA testing.

Annotated entities:
- Condition: "HBV infection"
- Measurement: "total hepatitis B core antibody [HBcAb]"
- Value: "positive"
- Measurement: "HBsAg"
- Value: "negative"
- Measurement: "HBV DNA"
- Value: "undetectable"
- Grammar_Error: "may be included"
- Non-query-able: "These patients must be willing to undergo monthly DNA testing."